下列有關脾臟（spleen）發育之敘述，何項錯誤？
A. 最早出現於背側胃繫膜（dorsal mesogastrium）之間
B. 源自前腸（foregut）內胚層（endoderm）
C. 原先位於胃之背側，後來因胃之旋轉而移至左側
D. 曾為造血器官

正確答案：B. 源自前腸（foregut）內胚層（endoderm）